Clinical trial exclusion criterion:
No informed consent for participation in the study, mental illness, which don't allow to obtain informed consent and conduct the treatment according to the protocol

Annotated entities:
- Non-query-able: "No informed consent for participation in the study, mental illness, which don't allow to obtain informed consent and conduct the treatment according to the protocol"